Clinical trial exclusion criterion:
Known hypersensitivity to zoledronic acid or other bisphosphonates

Entity relations:
- AND("hypersensitivity", "zoledronic acid")
- OR("zoledronic acid", "other bisphosphonates")